一位 80 歲男性住院病人，之前並無精神科或失智症病史，也沒有酒精或其他物質濫用的問題，自內科加護病房轉入一般病房，當天晚上出現幻聽、幻視、無法判別時間、地點等表現，且合併有失眠和激動等干擾行為，到了白天狀況略有改善，家屬表示之前並無類似的精神症狀表現，僅在半年前因為中風於住院期間曾出現過短暫類似的情況。該病人目前的表現最可能為下列何種診斷？
A. 精神分裂症（schizophrenia）
B. 失智症併有行為障礙（dementia with behavioural and psychological symptoms）
C. 譫妄症（delirium）
D. 前次中風的後遺症

正確答案：C. 譫妄症（delirium）